Clinical trial exclusion criterion:
Subject with a history of myocardial infarction, stroke or life-threatening arrhythmia within 6 months prior to screening

Annotated entities:
- Condition: "myocardial infarction"
- Condition: "stroke"
- Condition: "arrhythmia"
- Qualifier: "life-threatening"
- Temporal: "within 6 months prior to screening"
- Reference_point: "screening"